下列有關抗原決定位（epitope）之敘述，何者正確？
A. 一個蛋白質只具備一種抗原決定位
B. 能被抗體之 Fc 部位辨識
C. 能被抗體之 Fab 部位辨識
D. 能被 Fc 受器（Fc-receptor）辨識

正確答案：C. 能被抗體之 Fab 部位辨識